Paciente que presenta poliuria y polidipsia con una densidad específica de la orina superior a 1.040. De las siguientes opciones indique el diagnóstico más probable:
1. Intoxicación alcohólica.
2. Supresión de ADH (vasopresina) por barbituratos.
3. Diabetes mellitus.
4. Toxicidad por Litio que provoca diabetes insípida.
5. Déficit central de ADH (vasopresina).

Respuesta correcta: 3. Diabetes mellitus.